Clinical trial exclusion criterion:
11. History of portal hypertension or chronic liver disease, including positive serology for infection with HCV and/or HBV.

Entity relations:
- Has_value("serology for infection HBV", "positive")
- Has_value("serology for infection with HCV", "positive")
- Subsumes("chronic liver disease", "serology for infection with HCV")
- OR("serology for infection with HCV", "serology for infection HBV")
- OR("portal hypertension", "chronic liver disease")